Clinical trial inclusion criterion:
HCV RNA evidence of HCV infection

Entity relations:
- AND("HCV RNA", "HCV infection")